Mean arterial pressure less than 55 mmHg despite appropriate fluid resuscitation and vasopressor support.

The above is a clinical trial exclusion criterion. Annotated with entity spans:
[Measurement: Mean arterial pressure] [Value: less than 55 mmHg] despite appropriate [Procedure: fluid resuscitation] and [Procedure: vasopressor] support.